有關破傷風梭菌（Clostridium tetani ）之敘述，下列何者正確？
A. 致病是因產生破傷風痙攣毒素（tetanospasmin）抑制神經傳導物質乙醯膽鹼（acetylcholine）的釋放
B. 病菌會藉血流散佈全身，引發全身性破傷風
C. 施打破傷風抗毒素球蛋白（antitoxin globulin）有助於治療破傷風
D. 施打破傷風疫苗預防破傷風，是屬於被動免疫

正確答案：C. 施打破傷風抗毒素球蛋白（antitoxin globulin）有助於治療破傷風